Any organic lesion with high risk of bleeding (e.g.: active peptic ulcer, hemorrhagic stroke, cerebral aneurysm or cerebral neoplasms).

The above is a clinical trial exclusion criterion. Annotated with entity spans:
Any [Condition: organic lesion] with [Qualifier: high] [Observation: risk of bleeding] (e.g.: [Condition: active peptic ulcer], [Condition: hemorrhagic stroke], [Condition: cerebral aneurysm] or [Condition: cerebral neoplasms]).